La versión española del Listado de Conductas Infantiles (CBCL) de Achenbach:
1. Está baremada sólo para niños en edad escolar.
2. Carece de una versión para maestros.
3. Es aplicable a población general, pero no a la clínica.
4. Evalúa síndromes externalizantes e internalizantes.

Respuesta correcta: 4. Evalúa síndromes externalizantes e internalizantes.